CHB patients who had received NAs for more than 12 months.

The above is a clinical trial inclusion criterion. Annotated with entity spans:
[Condition: CHB] patients who had received [Drug: NAs] for [Temporal: more than 12 months.]